Metastatic disease (M1)/stage 4 NSCLC

The above is a clinical trial exclusion criterion. Annotated with entity spans:
[Condition: Metastatic disease] [Condition: (M1)/stage 4] NSCLC